Es similar a la del plasma sanguíneo la concentración de electrolitos en:
1. Jugo pancreático inducido por secretina.
2. Saliva primaria.
3. Jugo gástrico inducido por gastrina.
4. Bilis tras su paso por la vesícula biliar.

Respuesta correcta: 2. Saliva primaria.